Clinical trial inclusion criterion:
Females undergoing Intra-Cytoplasmic Sperm Injection (ICSI) cycles

Annotated entities:
- Procedure: "Intra-Cytoplasmic Sperm Injection (ICSI) cycles"
- Temporal: "undergoing"
- Person: "Females"